使用紅血球生成素（erythropoietin）治療腎性貧血時，應注意充分補充那一種元素？
A. 鉀
B. 鎂
C. 鐵
D. 銅

正確答案：C. 鐵